Clinical trial inclusion criterion:
Miller class 1, 2 and 3 recession defects will be included

Entity relations:
- AND("recession defects", "Miller")
- OR("Miller", "class 1, 2 and 3")